Clinical trial exclusion criterion:
Sensitivity to Mebeverine

Annotated entities:
- Drug: "Mebeverine"
- Condition: "Sensitivity"